Clinical trial exclusion criterion:
Allergic to study drugs

Annotated entities:
- Condition: "Allergic"
- Drug: "study drugs"